Durante la sístole ventricular:
1. Se expulsa toda la sangre ventricular.
2. La presión intraventricular es igual en ambos ventrículos.
3. El volumen ventricular empieza a disminuir desde el principio de la contracción.
4. Las válvulas aurículo-ventriculares están abiertas.
5. Las aurículas están relajadas.

Respuesta correcta: 5. Las aurículas están relajadas.